Clinical trial exclusion criterion:
Chronic use of opioid

Annotated entities:
- Multiplier: "Chronic use"
- Drug: "opioi"